Clinical trial inclusion criterion:
intramural or subserosal leiomyomas,

Annotated entities:
- Condition: "subserosal leiomyomas"
- Condition: "intramural leiomyomas"